What is Etizolam?

Etizolam is a thienodiazepine derivative, with high affinity for the benzodiazepine site of GABAA receptors.